If female, may participate if she is not pregnant, not breastfeeding, and at least one of the following: 1) Not a woman of childbearing potential (WOCBP); or 2) A WOCBP who agrees to follow the study contraceptive guidance during the treatment period and for at least 7 days after the last dose of study treatment.

The above is a clinical trial inclusion criterion. Annotated with entity spans:
If [Person: female], may participate if she is [Negation: not] [Condition: pregnant], [Negation: not] [Observation: breastfeeding], and [Multiplier: at least one] of the following: 1) [Negation: Not] a [Condition: woman of childbearing potential (WOCBP)]; or 2) A [Condition: WOCBP] who agrees to follow the study [Procedure: contraceptive guidance] [Temporal: during the treatment period] and [Temporal: for at least 7 days after the last dose of study treatment].